升結腸的動脈血主要來自：
A. 腹腔動脈幹（celiac trunk）
B. 腸繫膜上動脈（superior mesenteric artery）
C. 腸繫膜下動脈（inferior mesenteric artery）
D. 髂內動脈（internal iliac artery）

正確答案：B. 腸繫膜上動脈（superior mesenteric artery）